La hemocromatosis primaria es una enfermedad:
1. Mitocondrial.
2. Recesiva ligada al X.
3. Dominante ligada al X.
4. Autosómica recesiva.

Respuesta correcta: 4. Autosómica recesiva.